下列何者不是非免疫型水胎（hydrops fetalis）的原因？
A. 貧血
B. 心室中隔缺損
C. 第 13 對染色體異常
D. 巨細胞病毒感染

正確答案：B. 心室中隔缺損